Clinical trial exclusion criterion:
Any surgical or medical condition which might significantly alter the absorption, distribution, metabolism, or excretion of study drugs, including, but not limited to, any of the following: History of active inflammatory bowel disease during the 12 months. Active duodenal or gastric ulcers during the 3 months. Evidence of hepatic disease as determined by any one of the following: aspartate aminotransferase or alanine aminotransferase values exceeding 2x upper limit of normal, history of hepatic encephalopathy, history of oesophageal varices, or history of porto-caval shunt. Current treatment with cholestyramine or colestipol resins.

Annotated entities:
- Condition: "surgical condition"
- Condition: "medical condition"
- Condition: "alter the absorption, distribution, metabolism, or excretion"
- Drug: "study drugs"
- Condition: "inflammatory bowel disease"
- Temporal: "during the 12 months"
- Qualifier: "active"
- Qualifier: "Active"
- Condition: "duodenal ulcers"
- Condition: "gastric ulcers"
- Temporal: "during the 3 months"
- Condition: "hepatic disease"
- Measurement: "aspartate aminotransferase"
- Measurement: "alanine aminotransferase"
- Value: "exceeding 2x upper limit of normal"
- Condition: "hepatic encephalopathy"
- Temporal: "history"
- Condition: "oesophageal varices"
- Temporal: "history"
- Temporal: "history"
- Condition: "porto-caval shunt"
- Procedure: "treatment"
- Temporal: "Current"
- Drug: "cholestyramine resins"
- Drug: "colestipol resins"
- Mood: "Evidence"